Clinical trial inclusion criterion:
18 - 64 years old

Entity relations:
- Has_value("old", "18 - 64 years")